關於唇顎裂之發生率的敘述，何者為非？
A. 亞洲人發生率為白種人的兩倍
B. 左側：右側：雙側＝6：3：1
C. 雙側唇裂有 86%合併顎裂
D. 67%的病患有 family history

正確答案：D. 67%的病患有 family history